Una mujer de 82 años es ingresada en el hospital por cansancio y molestias digestivas y es diagnosticada de cáncer de colon mediante colonoscopia. Es viuda. Sus médicos estiman que es competente y capaz de tomar decisiones. Sus hijos refieren que ellos siempre han tomado las decisiones por su madre e insisten en que a ella no se le haga ninguna referencia al cáncer, con amenaza de demanda si se le dice algo relativo al cáncer. ¿Cuál de las siguientes actuaciones es la más apropiada por parte de los médicos?
1. Preguntar al paciente si quiere que sus médicos le den la información sobre su enfermedad a ella o a sus hijos.
2. Aceptar los deseos de los hijos y pedir a todo el personal involucrado en el tratamiento que no le digan al paciente que tiene cáncer.
3. Explicar a los hijos que los médicos están obligados a dar al paciente toda la información relevante sobre su problema médico.
4. Pedir a sus hijos que estén presentes cuando le digan a su madre que tiene cáncer.

Respuesta correcta: 1. Preguntar al paciente si quiere que sus médicos le den la información sobre su enfermedad a ella o a sus hijos.